Patient must be 18 years or older

The above is a clinical trial inclusion criterion. Annotated with entity spans:
Patient must be [Value: 18] [Person: years] or older